Determina el cambio de isotipo de la cadena pesada de las inmunoglobulinas:
1. El receptor de la célula B.
2. La molécula CD40 y las citoquinas.
3. La IgM o la IgD de la membrana de los linfocitos.
4. La edad.
5. La localización del linfocito dentro del centro germinal.

Respuesta correcta: 2. La molécula CD40 y las citoquinas.